Clinical trial inclusion criterion:
Subject or subject's legally acceptable representative has provided informed consent.

Annotated entities:
- Post-eligibility: "Subject or subject's legally acceptable representative has provided informed consent."